Clinical trial exclusion criterion:
Pregnancy or planning to become pregnant

Annotated entities:
- Condition: "Pregnancy"
- Mood: "planning to become"
- Condition: "pregnant"